Clinical trial exclusion criterion:
Inability to follow directions or comprehend the English language

Annotated entities:
- Observation: "Inability to follow directions"
- Observation: "Inability to comprehend the English language"